Patients undergoing surgeries in the upper limb (arm, forearm or hand)

The above is a clinical trial inclusion criterion. Annotated with entity spans:
Patients undergoing [Procedure: surgeries] in the [Qualifier: upper limb] ([Qualifier: arm], [Qualifier: forearm] or [Qualifier: hand])